Clinical trial exclusion criterion:
the child has temperature > 39.0◦C or a severe acute illness as defined by the examining nurse

Annotated entities:
- Measurement: "temperature"
- Value: "> 39.0◦C"
- Person: "child"
- Qualifier: "severe"
- Condition: "acute illness"
- Qualifier: "as defined by the examining nurse"